Current or recent (last 60 days) tobacco or nicotine use

The above is a clinical trial exclusion criterion. Annotated with entity spans:
Current or recent ([Temporal: last 60 days]) [Observation: tobacco] or [Observation: nicotine use]